Clinical trial exclusion criterion:
Central venous oxygen saturation (ScvO2) < 60% despite optimization of hematocrit and volume status

Annotated entities:
- Measurement: "Central venous oxygen saturation (ScvO2)"
- Value: "< 60%"
- Procedure: "optimization of hematocrit"
- Observation: "volume status"
- Observation: "despite"